下列情況何者可以暫不考慮放置下腔靜脈過濾器（vena cava filter）？
A. 首次急性之肺動脈栓塞
B. 深部靜脈栓塞，且不適合使用抗凝血劑
C. 深部靜脈栓塞，且有慢性肺栓塞，並已造成肺高壓
D. 在足量之抗凝血劑治療下，仍反復多次靜脈栓塞

正確答案：A. 首次急性之肺動脈栓塞